4 歲大之男童主訴過去兩個月來間歇性地自肛門排出亮紅色之血便，但並無腹痛。理學檢查並無肛裂，但做直腸指診可見手套指端有血。此病人之診斷最可能為下列何者？
A. 潰瘍性結腸炎
B. 消化性潰瘍
C. 腸套疊
D. 幼年性息肉

正確答案：D. 幼年性息肉